Clinical trial inclusion criterion:
ECOG Score of 0 or 1.

Annotated entities:
- Measurement: "ECOG Score"
- Value: "0 or 1"